If smoking and/or other drug addiction is present

The above is a clinical trial exclusion criterion. Annotated with entity spans:
If [Observation: smoking] and/or other [Condition: drug addiction] is present